Clinical trial inclusion criterion:
true abstinence (periodic abstinence and withdrawal are not acceptable methods of contraception)

Annotated entities:
- Pregnancy_considerations: "true abstinence (periodic abstinence and withdrawal are not acceptable methods of contraception)"